The ability to perform a small visible contraction with dorsiflexion and hip flexor muscles

The above is a clinical trial inclusion criterion. Annotated with entity spans:
[Mood: The ability to] perform a [Procedure: small visible contraction with dorsiflexion and hip flexor muscles]